Clinical trial inclusion criterion:
Measurable or non-measurable disease per RECIST Version 1.1.

Annotated entities:
- Condition: "non-measurable disease"
- Condition: "Measurable disease"
- Procedure: "RECIST Version 1.1"